6. Incomplete colonoscopy due to causes except poor bowel preparation

The above is a clinical trial exclusion criterion. Annotated with entity spans:
[Parsing_Error: 6.] [Qualifier: Incomplete] [Procedure: colonoscopy] due to causes [Negation: except] [Condition: poor bowel preparation]